Clinical trial exclusion criterion:
Have other medical implants that may interact with MRI, e.g. abandoned implantable cardioverter defibrillator (ICD) leads or pacemaker leads other than MRI conditional, lead extensions, other active medical devices, non-MRI compatible devices, mechanical valve

Annotated entities:
- Device: "medical implants"
- Condition: "interact with MRI"
- Device: "abandoned implantable cardioverter defibrillator (ICD) leads"
- Device: "pacemaker leads"
- Negation: "other than"
- Device: "MRI conditional"
- Device: "lead extensions"
- Device: "active medical devices"
- Qualifier: "other"
- Device: "non-MRI compatible devices"
- Device: "mechanical valve"